Clinical trial exclusion criterion:
History of vitrectomy surgery, submacular surgery, or other surgical intervention for AMD

Entity relations:
- Has_qualifier("surgical intervention", "other")
- AND("vitrectomy surgery", "AMD")
- OR("vitrectomy surgery", "surgical intervention", "submacular surgery")